下列何者不是自閉症（autistic disorder）之診斷標準？
A. 社會互動能力的缺損
B. 語言發展的缺損
C. 情緒發展的缺損
D. 侷限性的重複行為或興趣

正確答案：C. 情緒發展的缺損